王先生，23 歲，身高 185 公分，體重 60 公斤，由於學生健診胸部 X 光片報告疑肺氣腫因而就醫，目前並無胸部不適，過去並無吸菸，家族亦無肺部先天疾病史，則安排下列何種檢查最為適當？
A. 肺部電腦斷層攝影
B. 肺功能激發試驗
C. 肺功能檢查：FVC、FEV、FEV1 及 DLCO（一氧化碳擴散試驗）
D. 動脈血氣體分析

正確答案：C. 肺功能檢查：FVC、FEV、FEV1 及 DLCO（一氧化碳擴散試驗）